一位 25 歲男性，二週前於 A 醫院接受鼻部手術後出院，今天突然流大量鼻血至 B 醫院急診。B 醫院之處置，以何者最為適當？
A. 驗血，不必說明原因，轉回原手術之 A 醫院處置
B. 以棉花塞鼻止血，並告知為原手術失敗造成，需回去找原來的醫師
C. 先行止血，待病情穩定，請病患回原手術醫師處治療
D. 止血，驗血，影像學檢查，並告知病患以後不要再回去原手術醫院了

正確答案：C. 先行止血，待病情穩定，請病患回原手術醫師處治療